Clinical trial exclusion criterion:
Refusal to participate in the study

Annotated entities:
- Post-eligibility: "Refusal to participate in the stud"